Has received ECT or MECT within 3 months prior to screening.

The above is a clinical trial exclusion criterion. Annotated with entity spans:
Has received [Procedure: ECT] or [Procedure: MECT] [Temporal: within 3 months prior to screening].